Clinical trial exclusion criteria:
1. Comorbidity with other severe or chronic eye conditions that in the judgment of the investigator will interfere with study assessments, such as corneal opacities and scars, dystrophies, epithelial scarring, infections, blood clots, etc.
2. Best corrected visual acuity (BCVA) at baseline <20/200.
3. Has a condition or history that, in the opinion of the investigator, may interfere significantly with the subject's participation in the study.
4. A woman who is pregnant, nursing an infant, or planning a pregnancy.
5. Has a known adverse reaction and/or sensitivity to the study drug or its components.
6. Routine use (more than twice a week) of a chlorinated swimming pool.
7. Unwilling or unable to cease using the following medications during the study period: Topical ocular cyclosporine (e.g. Restasis®), anti-histamines, antipsychotics, or eye gels.
8. Currently enrolled in an investigational drug or device study or have used an investigational drug or device within 30 days prior to Visit 1.

Annotated entities:
- Parsing_Error: "1."
- Subjective_judgement: "in the judgment of the investigator"
- Non-query-able: "will interfere with study assessments"
- Context_Error: "will interfere with study assessments"
- Condition: "corneal opacities"
- Condition: "corneal scars"
- Condition: "dystrophies"
- Condition: "epithelial scarring"
- Condition: "infections"
- Condition: "blood clots"
- Condition: "eye conditions"
- Qualifier: "will interfere with study assessments"
- Parsing_Error: "2."
- Measurement: "Best corrected visual acuity (BCVA)"
- Value: "<20/200"
- Temporal: "at baseline"
- Reference_point: "baseline"
- Parsing_Error: "3."
- Subjective_judgement: "in the opinion of the investigator"
- Subjective_judgement: "may interfere significantly"
- Non-query-able: "may interfere significantly"
- Parsing_Error: "4."
- Person: "woman"
- Condition: "pregnant"
- Condition: "nursing"
- Non-query-able: "planning"
- Condition: "pregnancy"
- Parsing_Error: "5."
- Condition: "adverse reaction to the study drug or its components"
- Condition: "sensitivity to the study drug or its components"
- Parsing_Error: "6."
- Multiplier: "more than twice a week"
- Multiplier: "Routine use"
- Observation: "chlorinated swimming pool"
- Non-query-able: "chlorinated swimming pool"
- Parsing_Error: "7."
- Post-eligibility: "Unwilling or unable"
- Non-query-able: "Unwilling or unable"
- Drug: "Topical ocular cyclosporine"
- Drug: "Restasis®"
- Drug: "anti-histamines"
- Drug: "antipsychotics"
- Drug: "eye gels"
- Temporal: "during the study period"
- Reference_point: "study period"
- Parsing_Error: "8."
- Drug: "investigational drug"
- Context_Error: "investigational drug"
- Device: "investigational device"
- Context_Error: "investigational device"
- Drug: "investigational drug"
- Context_Error: "investigational drug"
- Temporal: "within 30 days prior to Visit 1"
- Reference_point: "Visit 1"
- Device: "investigational device"